照射眼睛的光線過強時，瞳孔變小是因為下列何種因素？
A. 睫狀肌收縮
B. 虹膜環狀肌收縮
C. 晶狀體形狀改變
D. 睫狀肌舒張

正確答案：B. 虹膜環狀肌收縮